Target ulcer area between 0.5 and 5 sqcm, and more than 4 weeks old.

The above is a clinical trial inclusion criterion. Annotated with entity spans:
[Measurement: Target ulcer area] [Value: between 0.5 and 5 sqcm], and [Temporal: more than 4 weeks old].